¿Qué pruebas de la Escala de Inteligencia de Wechsler para Niños-Revisada (WISC-R) componen el “factor libre de distractibilidad”, en el que rinden peor los niños con trastorno por déficit atencional con hiperactividad?
1. Comprensión, Cubos y Claves.
2. Aritmética, Historietas y Rompecabezas.
3. Semejanzas, Dígitos y Figuras Incompletas.
4. Aritmética, Dígitos y Claves.
5. Información, Aritmética y Laberintos.

Respuesta correcta: 4. Aritmética, Dígitos y Claves.